Clinical trial exclusion criterion:
History of head injury or stroke

Annotated entities:
- Condition: "head injury"
- Condition: "stroke"
- Temporal: "History"